Clinical trial inclusion criterion:
130mmHg=SBP<180mmHg, or 80mmHg=DBP<110mmHg or ongoing anti-hypertensive therapy;

Entity relations:
- Has_value("SBP", "130mmHg")
- Has_value("SBP", "<180mmHg")
- Has_value("DBP", "80mmHg=")
- Has_value("DBP", "<110mmHg")
- Has_temporal("anti-hypertensive therapy", "ongoing")
- OR("SBP", "DBP", "anti-hypertensive therapy")